下列有關腹股溝疝氣（inguinal hernia）與小兒陰囊水腫（hydrocele）之敘述，何者錯誤？
A. 小兒的腹股溝疝氣大多是間接型的腹股溝疝氣。疝氣囊的形成是因為在胎兒時期的鞘狀突（processus vaginalis）沒有閉合而造成的
B. 疝氣的手術治療可在內環（internal ring）的位置做疝氣囊高位結紮術（high ligation）
C. 小兒的腹股溝疝氣與陰囊水腫，其形成的原因及過程完全不同，故治療的方式也不一樣
D. 一個本來沒有陰囊水腫的小男生突然出現陰囊水腫時，要仔細辨別是否與睪丸腫瘤、創傷、扭轉或副睪炎

正確答案：C. 小兒的腹股溝疝氣與陰囊水腫，其形成的原因及過程完全不同，故治療的方式也不一樣